Clinical trial exclusion criterion:
Patients with supine systolic blood pressure (SBP) = 180 mm Hg, or diastolic blood pressure (DBP) = 110 mm Hg.

Entity relations:
- Has_qualifier("systolic blood pressure", "supine")
- Subsumes("systolic blood pressure", "SBP")
- Has_value("systolic blood pressure", "= 180 mm Hg")
- Subsumes("diastolic blood pressure", "DBP")
- Has_value("diastolic blood pressure", "= 110 mm Hg")
- OR("systolic blood pressure", "diastolic blood pressure")